History of stable angina pectoris with angiographic evidence of CAD (diameter stenosis = 50%) in major, i.e., left main, left anterior descending, left circumflex, and right coronary arteries.

The above is a clinical trial inclusion criterion. Annotated with entity spans:
History of [Condition: stable angina pectoris] with [Qualifier: angiographic evidence] of [Condition: CAD] ([Observation: diameter stenosis] [Multiplier: = 50%]) in [Qualifier: major], i.e., [Qualifier: left main], [Qualifier: left anterior descending], [Qualifier: left circumflex], [Non-query-able: and] [Qualifier: right coronary arteries].